Clinical trial inclusion criterion:
normal treadmill stress test

Entity relations:
- Has_value("treadmill stress test", "normal")